下列何者屬於嗓音疾病（voice disorder）？
A. 發音障礙（dysphonia）
B. 失用症（apraxia）
C. 構音困難（dysarthria）
D. 失語症（aphasia）

正確答案：A. 發音障礙（dysphonia）